Clinical trial inclusion criteria:
Patients who are 19 years or older on screening
Patients with type 2 diabetes mellitus
Patients with 7.0% = HbA1c = 11.0% at the screening visit
Patients with Fasting Plasma Glucose <15mmol/L(270mg/dL) on screening

Annotated entities:
- Person: "years"
- Value: "19 or older"
- Temporal: "on screening"
- Reference_point: "screening"
- Condition: "type 2 diabetes mellitus"
- Measurement: "HbA1c"
- Value: "7.0% 11.0%"
- Temporal: "at the screening visit"
- Reference_point: "screening"
- Measurement: "Fasting Plasma Glucose"
- Value: "<15mmol/L"
- Value: "270mg/dL"
- Temporal: "on screening"
- Reference_point: "screening"